Confirmed platelet count < the LLN of the evaluating laboratory at Screening or documented at <100,000/µL within the past year on a sample without platelet clumping

The above is a clinical trial exclusion criterion. Annotated with entity spans:
[Qualifier: Confirmed] [Measurement: platelet count] [Value: < the LLN of the evaluating laboratory] [Temporal: at Screening] or documented at [Value: <100,000/µL] [Temporal: within the past year] on a [Qualifier: sample without platelet clumping]